estimated glomerular filtration rate (eGFR) < 45 ml/min/1.73m2

The above is a clinical trial exclusion criterion. Annotated with entity spans:
[Measurement: estimated glomerular filtration rate (eGFR)] [Value: < 45 ml/min/1.73m2]